treatment with dual antiplatelet therapy (clopidogrel and acetylsalicylic acid) between left atrial appendage closure and randomization

The above is a clinical trial inclusion criterion. Annotated with entity spans:
treatment with [Procedure: dual antiplatelet therapy] ([Drug: clopidogrel] and [Drug: acetylsalicylic acid]) [Temporal: between left atrial appendage closure and randomization]